Clinical trial exclusion criterion:
History of severe or multiple allergies

Annotated entities:
- Condition: "allergies"
- Qualifier: "severe"
- Qualifier: "multiple"
- Temporal: "History"